Ride home from dilator insertion clinic appointment

The above is a clinical trial inclusion criterion. Annotated with entity spans:
[Observation: Ride home] from [Procedure: dilator insertion] clinic appointment